Clinical trial exclusion criterion:
Has had clinically diagnosed hepatic encephalopathy in the last 6 months

Annotated entities:
- Condition: "hepatic encephalopathy"
- Temporal: "in the last 6 months"